Clinical trial inclusion criteria:
English speaking/literate
Age 18-100 years
Visual analog score pain >= 5
Greater than or equal to 3 months of pain after onset of symptoms that has failed conservative treatments
Confirmation of glenohumeral OA via imaging
Transient relief of symptoms after diagnostic intra-articular injection into the glenohumeral joint

Annotated entities:
- Post-eligibility: "English speaking/literate"
- Person: "Age"
- Value: "18-100 years"
- Measurement: "Visual analog score pain"
- Value: ">= 5"
- Condition: "pain"
- Temporal: "Greater than or equal to 3 months"
- Temporal: "after onset of symptoms"
- Reference_point: "onset of symptoms"
- Mood: "failed"
- Procedure: "conservative treatments"
- Condition: "glenohumeral OA"
- Procedure: "imaging"
- Procedure: "intra-articular injection"
- Qualifier: "glenohumeral joint"
- Condition: "relief of symptoms"
- Qualifier: "Transient"